Serum albumin level = 3.5g/dl, ultrasound or CT scan confirmed ascites (=Grade 1)

The above is a clinical trial inclusion criterion. Annotated with entity spans:
[Measurement: Serum albumin] level [Value: = 3.5g/dl], [Procedure: ultrasound] or [Procedure: CT scan] confirmed [Condition: ascites] (=[Qualifier: Grade 1])